Clinical trial exclusion criterion:
Significant risk of suicidal and/or self-harm behaviors

Annotated entities:
- Mood: "risk of"
- Observation: "suicidal behaviors"
- Observation: "self-harm behaviors"